¿Cuál de las siguientes vacunas parenterales está contraindicada durante el embarazo?
1. Vacuna frente al tétanos.
2. Vacuna frente al sarampión.
3. Vacuna frente a la tos ferina.
4. Vacuna frente a la hepatitis B.
5. Vacuna frente a la gripe.

Respuesta correcta: 2. Vacuna frente al sarampión.